Clinical trial exclusion criterion:
Cognitive impairment according to MiniCog

Annotated entities:
- Condition: "Cognitive impairment"
- Procedure: "MiniCog"